A una mujer de 55 años afectada de insuficiencia suprarrenal se le ha prescrito tratamiento con corticoides. ¿Cuál de las siguientes instrucciones le proporcionaría en relación con este tratamiento?
1. Tome el fármaco a primera hora de la mañana.
2. Ingiera el fármaco antes de acostarse.
3. Excluya de la dieta los alimentos ricos en calcio y vitamina D.
4. Consuma una dieta baja en calorías y proteínas.
5. Vigile la disminución de la presión arterial.

Respuesta correcta: 1. Tome el fármaco a primera hora de la mañana.